Clinical trial exclusion criterion:
Known coronary artery disease or type I DM with microvascular complications or signs of heart failure or clinical dissection of the aorta

Entity relations:
- AND("type I DM", "microvascular complications")
- OR("coronary artery disease", "type I DM", "heart failure", "dissection of the aorta")